下列何種症狀與佝僂症（rickets）最無關？
A. 兒童出現生長遲緩
B. 智力發育遲緩
C. 血中鈣濃度降低
D. 牙齒發育不全

正確答案：B. 智力發育遲緩